Need for long-term oral anticoagulation;

The above is a clinical trial inclusion criterion. Annotated with entity spans:
[Mood: Need for] [Procedure: long-term oral anticoagulation];